signs for central dysfunction

The above is a clinical trial exclusion criterion. Annotated with entity spans:
[Mood: signs] for [Condition: central dysfunction]